Clinical trial exclusion criterion:
3. Family history of hypertriglyceridemia or fasting triglyceride>4.56 mmol/L;

Annotated entities:
- Condition: "hypertriglyceridemia"
- Measurement: "fasting triglyceride"
- Value: ">4.56 mmol/L"
- Observation: "Family history"